Cardiopulmonary arrest

The above is a clinical trial exclusion criterion. Annotated with entity spans:
[Condition: Cardiopulmonary arrest]